Participation in another clinical trial within 30 days prior to baseline visit.

The above is a clinical trial exclusion criterion. Annotated with entity spans:
[Non-query-able: Participation in another clinical trial within 30 days prior to baseline visit.]